Prior treatment with cisplatin before randomization

The above is a clinical trial exclusion criterion. Annotated with entity spans:
Prior treatment with [Drug: cisplatin] [Temporal: before randomization]